Assessed by the investigator to be unable or unwilling to comply with the requirements of the protocol.

The above is a clinical trial exclusion criterion. Annotated with entity spans:
Assessed by the investigator to be [Observation: unable] or [Observation: unwilling to comply with the requirements of the protocol].